Clinical trial exclusion criterion:
LV ejection fraction < 50%.

Annotated entities:
- Measurement: "LV ejection fraction"
- Value: "< 50%"